Clinical trial exclusion criterion:
underlying lung or heart disase

Entity relations:
- OR("lung disase", "heart disase")